根據安寧緩和醫療條例的規定，不施行心肺復甦術只適用於那一類病人？
A. 末期病人
B. 開刀的病人
C. 急診病人
D. 植物人

正確答案：A. 末期病人